What is the function of the Eyeless associated gene in Drosophila?

Eyeless (ey) is one of the most critical transcription factors for initiating the entire eye development in Drosophila. Two Pax6 genes are in Drosophila: eyeless (ey) and twin of eyeless (toy)